Patients with Acute Myocardial Infarction (ST elevation myocardial infarction, Non ST elevation myocardial infarction)

The above is a clinical trial exclusion criterion. Annotated with entity spans:
Patients with [Condition: Acute Myocardial Infarction] ([Condition: ST elevation myocardial infarction], [Condition: Non ST elevation myocardial infarction])